What is the mode of inheritance of nemaline myopathy?

Nemaline  myopathy has a autosomal dominant or recessive mode of inheritance.